Acude al Centro de Salud un niño de 4 años que, 5 minutos antes, comienza con cuadro de angioedema en cara, conjuntivitis, congestión nasal y ronquera, coincidiendo con la ingesta de una cucharada de yogur que le dieron por error en el colegio. Entre los antecedentes está diagnosticado de alergia a proteínas de leche de vaca. En la exploración se constata hipotensión leve, frecuencia cardiaca 110 lat/min, Sat O2 93%, está pálido y algo sudoroso, con sibilancias diseminadas. ¿Cuál es el primer tratamiento de elección?
1. Provocar el vómito.
2. Adrenalina 1/1000 subcutánea.
3. Adrenalina 1/1000 intramuscular.
4. Metilprednisona intramuscular.
5. Salbutamol nebulizado.

Respuesta correcta: 3. Adrenalina 1/1000 intramuscular.